Clinical trial exclusion criteria:
Limited English proficiency (LEP)
Pregnant
Prisoners
Wolff Parkinson White syndrome
Administration of electrical or chemical cardioversion before screening
Administration of other antiarrhythmics for acute heart rate control (excluding adenosine)
History of allergy or idiosyncratic reaction to diltiazem
Unable to take oral medications
Heart rate <60 beats/min

Annotated entities:
- Observation: "Limited English proficiency"
- Observation: "LEP"
- Condition: "Pregnant"
- Person: "Prisoners"
- Condition: "Wolff Parkinson White syndrome"
- Procedure: "chemical cardioversion"
- Procedure: "electrical cardioversion"
- Temporal: "before screening"
- Reference_point: "screening"
- Drug: "antiarrhythmics"
- Qualifier: "acute"
- Procedure: "heart rate control"
- Negation: "excluding"
- Drug: "adenosine"
- Condition: "allergy"
- Condition: "idiosyncratic reaction"
- Drug: "diltiazem"
- Condition: "Unable to take"
- Drug: "oral medications"
- Measurement: "Heart rate"
- Value: "<60 beats/min"